Mujer de 69 años que consulta por expectoración hemoptoica. En los dos meses previos presentaba febrícula, astenia, anorexia y pérdida de peso no cuantificada. En el análisis citológico     de    esputo      se    observaron hemosiderófagos y en la radiografía de tórax infiltrados alveolares bilaterales. Analíticamente destacaba: Hb 8.2gr/dL, PO2: 58mmHg, creatinina: 5mg/dL, orina: proteinuria +++ microhematuria, cilindros, hemáticos. ANCAp (anticuerpos contra el citoplasma de los neutrofilos perinuclear): positivos: anticuerpos antimembrana basal glomerular: negativos. Anticuerpos antinucleares: negativos. El diagnóstico más probable sería:
1. Hemosiderosis pulmonar idiopática.
2. Síndrome de Goopasture.
3. Lupus eritematoso sistémico con afectación renal severa.
4. Poliarteritis nodosa clásica.
5. Poliarteritis microscópica.

Respuesta correcta: 5. Poliarteritis microscópica.